giving written consent to participate in the study

The above is a clinical trial inclusion criterion. Annotated with entity spans:
[Informed_consent: giving written consent to participate in the study]